Clinical trial inclusion criterion:
HCV RNA level at most 6 months prior to the Baseline/Day 1 visit.

Entity relations:
- Has_temporal("HCV RNA level", "at most 6 months prior to the Baseline/Day 1 visit")
- Has_index("at most 6 months prior to the Baseline/Day 1 visit", "the Baseline/Day 1 visit")